Adequate kidney function (serum creatinine < 1.5 mg/dL)

The above is a clinical trial inclusion criterion. Annotated with entity spans:
[Value: Adequate] [Measurement: kidney function] ([Measurement: serum creatinine] [Value: < 1.5 mg/dL])